History of coronary revascularization, i.e., percutaneous coronary intervention (PCI) or coronary artery bypass graft (CABG), not including the elective PCI during the index hospitalization

The above is a clinical trial inclusion criterion. Annotated with entity spans:
History of [Procedure: coronary revascularization], i.e., [Procedure: percutaneous coronary intervention] ([Procedure: PCI]) or [Procedure: coronary artery bypass graft] ([Procedure: CABG]), [Negation: not] including the [Qualifier: elective] [Procedure: PCI] [Temporal: during the index hospitalization]